Clinical trial exclusion criterion:
Patients who had received non-surgical periodontal treatment within the past 6 months

Entity relations:
- Has_temporal("non-surgical periodontal treatment", "within the past 6 months")